Clinical trial exclusion criterion:
Moderate to severe pulmonary dysfunction (GOLD II, II, IV)

Entity relations:
- Has_value("GOLD", "II, II, IV")
- Has_qualifier("pulmonary dysfunction", "Moderate")
- Subsumes("Moderate", "GOLD")
- OR("Moderate", "severe")